What is the mechanism of the drug CRT0066101?

CRT0066101 inhibits protein kinase D